高媽媽帶	剛滿11個月的小孩前來看咳嗽及流鼻水，詢問高媽媽有關高小弟的疫苗接種情況，依據衛生福利部國民健康署的建議，高小弟應已接受下列那些疫苗注射？①卡介苗 ②B型肝炎 ③白喉破傷風百日咳混合疫苗 ④小兒麻痺口服疫苗 ⑤水痘疫苗 ⑥麻疹腮腺炎德國麻疹混合疫苗 ⑦日本腦炎疫苗 ⑧破傷風減量白喉混合疫苗？
A. ③④⑤⑥⑦
B. ①②③④
C. ①③④⑤⑥
D. ①②⑤⑧

正確答案：B. ①②③④